Prior monoclonal antibody, radioimmunoconjugate, antibody drug conjugate, phototherapy, radiotherapy, chemotherapy, immunotherapy, immunosuppressive therapy, or any test agent within 3 weeks or for alemtuzumab 8 weeks of Day 1.

The above is a clinical trial exclusion criterion. Annotated with entity spans:
Prior [Drug: monoclonal antibody], [Drug: radioimmunoconjugate], [Drug: antibody drug conjugate], [Procedure: phototherapy], [Procedure: radiotherapy], [Procedure: chemotherapy], [Procedure: immunotherapy], [Procedure: immunosuppressive therapy], or any test agent [Temporal: within 3 weeks] or for [Drug: alemtuzumab] [Temporal: 8 weeks of Day 1].